Between which probes does the recurrent translocation breakpoint on chromosome 22 of neuroepithelioma lie?

The recurrent translocation breakpoint on chromosome 22 of neuroepithelioma has been localized between two probes, D22S1 and D22S15, by both in situ hybridization and somatic cell hybrids